5. Current use (any use in the past 4 weeks, chronic use within 6 past six months) of any investigational drug or of any medications with psychotropic, anti or pro-convulsive action.

The above is a clinical trial exclusion criterion. Annotated with entity spans:
[Parsing_Error: 5.] [Qualifier: Current use] ([Qualifier: any use] [Temporal: in the past 4 weeks], [Qualifier: chronic use] [Temporal: within 6 past six months]) of any [Drug: investigational drug] or of any [Drug: medications] with [Qualifier: psychotropic], anti or [Qualifier: pro-convulsive action].